Previous thoracic operation in the same side.

The above is a clinical trial exclusion criterion. Annotated with entity spans:
[Temporal: Previous] [Procedure: thoracic operation] in the [Qualifier: same side].